Clinical trial exclusion criterion:
planned surgical duration more than 3 hours

Entity relations:
- Has_value("planned surgical duration", "more than 3 hours")